Clinical trial inclusion criterion:
Elective Female Pelvic Medicine and Reconstructive Surgery or Gynecologic Minimally Invasive surgeries including hysterectomy, suburethral sling, and pelvic organ prolapse repair that require cystoscopy.

Annotated entities:
- Qualifier: "Elective"
- Qualifier: "Female Pelvic"
- Procedure: "Reconstructive Surgery"
- Drug: "Medicine"
- Qualifier: "Gynecologic"
- Qualifier: "Minimally Invasive"
- Procedure: "surgeries"
- Procedure: "hysterectomy"
- Procedure: "suburethral sling"
- Procedure: "pelvic organ prolapse repair"
- Procedure: "cystoscopy"
- Mood: "require"